Clinical trial exclusion criterion:
Evidence of neoplastic diseases of the liver

Annotated entities:
- Condition: "neoplastic diseases"
- Qualifier: "liver"